Clinical trial inclusion criterion:
Sweat chloride equal or greater than 60 mEq/L by quantitative pilocarpine iontophoresis test.

Annotated entities:
- Measurement: "Sweat chloride"
- Value: "equal or greater than 60 mEq/L"
- Measurement: "quantitative pilocarpine iontophoresis test"